Clinical trial inclusion criterion:
History of AP above ULN for at least six months

Entity relations:
- Has_value("AP", "above ULN")
- Has_temporal("AP", "for at least six months")